Clinical trial inclusion criterion:
Mini Mental Status (MMS) test between 16 to 26 inclusive

Entity relations:
- Has_value("Mini Mental Status (MMS) tes", "between 16 to 26 inclusive")